What is the role of Gata3 in Th2 cells?

GATA3 is responsible for induction of T(h)2 differentiation and represses T(h)1 differentiation. Posttranslational modifications of Gata3 control the regulation of IFNg expression in memory Th2 cells.